Clinical trial exclusion criterion:
Severe liver and renal dysfunction

Annotated entities:
- Condition: "liver dysfunction"
- Condition: "renal dysfunction"
- Qualifier: "Severe"